Clinical trial inclusion criteria:
Only patients with atrial fibrillation, above 18 years, and with TTR <50% based on the last three values of INR will be included in this study.

Annotated entities:
- Condition: "atrial fibrillation"
- Value: "above 18 years"
- Person: "years"
- Measurement: "TTR"
- Value: "<50%"
- Qualifier: "based on the last three values of INR"